Clinical trial inclusion criterion:
Bilirubin <1.25 times the upper limit of normal (ULN)

Entity relations:
- Has_value("Bilirubin", "<1.25 times the upper limit of normal")